下列何者最少見於男性女乳症（gynecomastia）之成因？
A. 男性賀爾蒙缺乏（androgen deficiency）
B. 內分泌缺損（endocrine defects）
C. 藥物（drugs）
D. 外傷（trauma）

正確答案：D. 外傷（trauma）